Clinical trial exclusion criterion:
Cochlear implant

Annotated entities:
- Device: "Cochlear implant"